Clinical trial exclusion criterion:
Office or average home SBP > 180 mm Hg or DBP > 110 mm Hg (Average home BP in any seven day period during trial)

Annotated entities:
- Measurement: "SBP"
- Value: "> 180 mm Hg"
- Measurement: "DBP"
- Value: "> 110 mm Hg"